Clinical trial exclusion criterion:
Patients who are hemodynamically unstable even if they have hemoglobin levels> 6g / dL.

Annotated entities:
- Condition: "hemodynamically unstable"
- Measurement: "hemoglobin levels"
- Value: "> 6g / dL"